Medical Stability

The above is a clinical trial inclusion criterion. Annotated with entity spans:
[Condition: Medical Stability]